Clinical trial exclusion criterion:
contraindication for collagenase clostridium histolyticym (Xiapex/Xiaflex ®)

Entity relations:
- Subsumes("collagenase clostridium histolyticym", "Xiapex")
- AND("contraindication", "collagenase clostridium histolyticym")
- OR("Xiapex", "Xiaflex")